Clinical trial exclusion criterion:
An active or a history of a psychiatric disorder including, but not limited to, depression, schizophrenia, bipolar disorder, anxiety, or other psychiatric disorders;

Entity relations:
- Has_qualifier("psychiatric disorders", "other")
- Subsumes("psychiatric disorder", "depression")
- Has_qualifier("psychiatric disorder", "active")
- OR("active", "history")
- OR("depression", "schizophrenia", "bipolar disorder", "anxiety", "psychiatric disorders")